La exposición con prevención de respuesta es actualmente una de las técnicas más útiles para el tratamiento de:
1. La ansiedad social.
2. El trastorno obsesivo compulsivo.
3. Las fobias específicas.
4. La bulimia nerviosa.

Respuesta correcta: 2. El trastorno obsesivo compulsivo.